Clinical trial inclusion criterion:
have a diagnosis of locally advanced or metastatic melanoma

Entity relations:
- Has_qualifier("melanoma", "locally advanced")
- OR("locally advanced", "metastatic")